口咽膜（oropharyngeal membrane）是由下列何者組成？
A. 內胚層和外胚層
B. 內胚層和中胚層
C. 中胚層和外胚層
D. 僅由外胚層組成

正確答案：A. 內胚層和外胚層